Diagnosis of chronic HCV infection, defined as positive HCV antibody or HCV RNA more than 6 months prior to screening OR an assessment of fibrosis F2 or greater prior to screening.

The above is a clinical trial inclusion criterion. Annotated with entity spans:
Diagnosis of [Condition: chronic HCV infection], defined as [Value: positive] [Measurement: HCV antibody] or [Measurement: HCV RNA] [Temporal: more than 6 months prior to screening] OR an [Measurement: assessment of fibrosis] [Value: F2 or greater] [Temporal: prior to screening].